Which method has been developed for detection of ATAC-seq or ChIP-seq signals with DNA methylation?

EpiMethyl tag is a method that combines ATAC-seq or ChIP-seq (M-ATAC or M-ChIP) with bisulfite conversion, to simultaneously examine accessibility/TF binding and methylation on the same DNA.